Clinical trial inclusion criterion:
Liver disease

Annotated entities:
- Condition: "Liver disease"